What phenotype is associated with the V60L mutation in the human MC1R gene?

The V60L variant, which is common in the population may act as a partially penetrant recessive allele. Both of these Thr(111)/Ala(111) heterozygotes carried a single polymorphism of MC1R (one with the V92M variant and another with the V60L variant) different frequencies for the melanoma-risk allele V60L (a mutation also associated to red hair and fair skin and even blonde hair) Genetic association and cellular function of MC1R variant alleles in human pigmentation.